Which is the chromosomal location of the gene MAOA?

The MAOA gene is locatad on chromosome X (Xp21-p11).